ECOG PS of 0-2;

The above is a clinical trial inclusion criterion. Annotated with entity spans:
[Measurement: ECOG PS] of [Value: 0-2];